下列何者不是肥厚型心肌病變的心因性猝死主要預測因子？
A. 病患有猝死的家族病史
B. 病患左心室超音波顯示有異常的肥厚＞30 mm
C. 年輕病患在運動達到最高量過程時，血壓上升
D. 病患24小時心電圖顯示有自發性，但出現時間＜30秒的心室頻脈（spontaneous nonsustained ventricular tachycardia）

正確答案：C. 年輕病患在運動達到最高量過程時，血壓上升